Clinical trial exclusion criterion:
insufficient contraception (only for substudy 3)

Annotated entities:
- Qualifier: "insufficient"
- Procedure: "contraception"